Clinical trial inclusion criterion:
Aged 1 to < 6 years

Entity relations:
- Has_value("Aged", "1 to < 6 years")